Pregnant woman

The above is a clinical trial exclusion criterion. Annotated with entity spans:
[Condition: Pregnant] [Person: woman]